Clinical trial inclusion criterion:
Transfer of patient to Riley Hospital for Children prior to any abdominal surgery

Annotated entities:
- Visit: "Riley Hospital for Children"
- Temporal: "prior to any abdominal surgery"
- Procedure: "abdominal surgery"
- Reference_point: "any abdominal surgery"
- Procedure: "Transfer"